Clinical trial exclusion criterion:
Abnormal 12-lead electrocardiogram (ECG) at screening or pre-dose (Day -1 or Day 1), except minor deviations deemed to be of no clinical significance by the Investigator.

Entity relations:
- Has_value("12-lead electrocardiogram (ECG)", "Abnormal")
- Has_index("at screening", "screening")
- Has_index("at pre-dose", "pre-dose")
- OR("Day -1", "Day 1")